下列有關 statin 敘述，何者錯誤？
A. 主要作用於 HMG-CoA reductase，抑制膽固醇生合成
B. 引發高親和力 LDL receptor 表現增加
C. atorvastatin 屬於 prodrug，必須經腸道代謝成活性代謝物
D. 可與 cholestyramine 合用，達到降膽固醇之相加作用

正確答案：C. atorvastatin 屬於 prodrug，必須經腸道代謝成活性代謝物